Clinical trial inclusion criterion:
Serum ALT within normal limits with no history of liver disease

Annotated entities:
- Measurement: "Serum ALT"
- Value: "within normal limits"
- Negation: "no"
- Temporal: "history"
- Condition: "liver disease"